Clinical trial exclusion criterion:
severe gastroparesis requiring endoscopic placement of capsule

Entity relations:
- AND("endoscopic placement", "capsule")
- Has_mood("endoscopic placement", "requiring")
- Has_qualifier("gastroparesis", "severe")
- AND("gastroparesis", "endoscopic placement")